Clinical trial exclusion criterion:
unwilling/unable to sign informed consent document

Annotated entities:
- Post-eligibility: "unwilling/unable to sign informed consent document"